Clinical trial exclusion criterion:
Total bilirubin level exceeded 2 mg / dL

Entity relations:
- Has_value("Total bilirubin level", "exceeded 2 mg / dL")